Clinical trial inclusion criterion:
The patients have normal cardiac functions by echocardiography.

Entity relations:
- AND("normal cardiac functions", "echocardiography")